Clinical trial exclusion criterion:
Subject is immunologically suppressed, received steroids >1 month over the past year.

Entity relations:
- Has_multiplier("steroids", ">1 month")
- Has_temporal("steroids", "over the past year")
- OR("immunologically suppressed", "steroids")